Clinical trial exclusion criteria:
Abnormal karyotype
Previous pelvic or abdominal radiotherapy
Previous surgical management of ovarian pathology
Chronic disease: renal, liver, cardiac, malignancy

Annotated entities:
- Condition: "Abnormal karyotype"
- Procedure: "pelvic radiotherapy"
- Procedure: "abdominal radiotherapy"
- Temporal: "Previous"
- Procedure: "surgical management"
- Condition: "ovarian pathology"
- Temporal: "Previous"
- Condition: "renal malignancy"
- Condition: "cardiac malignancy"
- Condition: "liver malignancy"
- Condition: "Chronic disease"
- Undefined_semantics: "Chronic disease"